Expected life-span less than <1 year

The above is a clinical trial exclusion criterion. Annotated with entity spans:
[Observation: Expected life-span] [Value: less than <1 year]